El dolor opresivo/tirante, de ligera a moderada intensidad, de localización bilateral y que no empeora con la actividad física rutinaria, es el que ocurre en:
1. El dolor pélvico.
2. El burnout.
3. El asma.
4. El síndrome del intestino irritable.
5. La cefalea tensional.

Respuesta correcta: 5. La cefalea tensional.